whose parents or legal guardians accept and sign the consent form

The above is a clinical trial inclusion criterion. Annotated with entity spans:
[Informed_consent: whose parents or legal guardians accept and sign the consent form]